Clinical trial inclusion criterion:
Weight stable (<3 kg weight change within last 3 months)

Annotated entities:
- Measurement: "Weight"
- Qualifier: "stable"
- Value: "<3 kg weight change"
- Temporal: "within last 3 months"